Clinical trial exclusion criterion:
dextromethorphan in any form (eg, OTC cold medicines)

Entity relations:
- Has_qualifier("dextromethorphan", "any form")